Clinical trial exclusion criterion:
Persons with a history of Guillain-Barré Syndrome

Annotated entities:
- Condition: "Guillain-Barré Syndrome"